Clinical trial inclusion criterion:
Pathologically diagnosed with advanced gastric cancer (including adenocarcinoma of the gastroesophageal junction) with measurable metastases outside the stomach (measuring = 10mm on spiral CT scan, satisfying the criteria in RECIST 1.1);

Entity relations:
- Has_qualifier("adenocarcinoma", "gastroesophageal junction")
- Subsumes("advanced gastric cancer", "adenocarcinoma")
- Has_qualifier("metastases", "stomach")
- Has_negation("stomach", "outside")
- OR("advanced gastric cancer", "metastases")